Positive serology for HIV, HCV, HBV.

The above is a clinical trial exclusion criterion. Annotated with entity spans:
[Value: Positive] [Measurement: serology for HIV], HCV, HBV.